Clinical trial exclusion criterion:
Administration of electrical or chemical cardioversion before screening

Annotated entities:
- Procedure: "chemical cardioversion"
- Procedure: "electrical cardioversion"
- Temporal: "before screening"
- Reference_point: "screening"